Clinical trial inclusion criterion:
The group of patients who participated in the study included adults aged at least 19 years among the atraumatic CA outpatients who came to the ER and received CPR.

Annotated entities:
- Person: "adults"
- Person: "aged"
- Value: "at least 19 years"
- Condition: "atraumatic CA"
- Visit: "outpatients"
- Visit: "ER"
- Procedure: "CPR"